Clinical trial exclusion criterion:
Age < 20 or > 35 years.

Entity relations:
- Has_value("Age", "< 20 or > 35 years")